Clinical trial inclusion criterion:
Minimum MADRS score = 15.

Annotated entities:
- Measurement: "MADRS score"
- Value: "Minimum = 15"